Clinical trial exclusion criterion:
Continuous and/or progressive visual loss > 18 months or serous detachment on OCT > 18 months;

Annotated entities:
- Qualifier: "Continuous"
- Qualifier: "progressive"
- Condition: "visual loss"
- Temporal: "> 18 months"
- Condition: "serous detachment"
- Procedure: "OCT"
- Temporal: "> 18 months"